Subject has thrombocytosis (platelet count > 600,000 / µl) or thrombocytopenia (platelet count <100,000 / µl).

The above is a clinical trial exclusion criterion. Annotated with entity spans:
Subject has [Condition: thrombocytosis] ([Measurement: platelet count] [Value: > 600,000 / µl]) or [Condition: thrombocytopenia] ([Measurement: platelet count] [Value: <100,000 / µl]).